一位 69歲男性病人因急性心肌梗塞住院。五天後，病人呼吸較喘，身體檢查顯示有新的心尖部心縮期雜音、血壓80/50  mmHg、中心靜脈壓 30 mmHg、胸部 X 光顯示肺水腫現象。下列敘述何者錯誤？①診斷為心室中隔破裂 ②須裝置主動脈內氣球幫浦 ③不須緊急手術 ④手術死亡率約10%至20%
A. ①②③
B. 僅①③
C. ②④
D. 僅④

正確答案：B. 僅①③